Clinical trial inclusion criterion:
Male or female

Entity relations:
- OR("Male", "female")